Clinical trial exclusion criterion:
Chronic Kidney Disease (CKD)

Annotated entities:
- Condition: "Chronic Kidney Disease (CKD)"